Clinical trial exclusion criterion:
History of alcohol or drug dependence or abuse in the last three years

Entity relations:
- Has_temporal("alcohol dependence", "in the last three years")
- OR("alcohol dependence", "drug dependence", "alcohol abuse", "drug abuse")